Patients will be excluded if they could not tolerate MET during the recommended titration schedule outlined in the protocol;

The above is a clinical trial exclusion criterion. Annotated with entity spans:
Patients will be excluded if they could [Condition: not tolerate] [Drug: MET] during the recommended titration schedule outlined in the protocol;